Clinical trial exclusion criterion:
Known or suspected hepatic, symptomatic biliary disease (this includes moderate to severe chronic hepatic impairment)

Entity relations:
- Has_qualifier("chronic hepatic impairment", "moderate")
- Subsumes("hepatic disease", "chronic hepatic impairment")
- OR("hepatic disease", "biliary disease")
- OR("moderate", "severe")